Inability to swallow oral medication

The above is a clinical trial exclusion criterion. Annotated with entity spans:
[Condition: Inability to swallow oral medication]